Clinical trial exclusion criterion:
Clinically significant cardiac disease (New York Heart Association Class III/IV),or severe debilitating puhnonary disease.

Entity relations:
- Has_value("New York Heart Association", "Class III/IV")
- Subsumes("significant", "New York Heart Association")
- Has_qualifier("cardiac disease", "significant")
- Has_qualifier("debilitating puhnonary disease", "severe")